Patients previously enrolled in this trial

The above is a clinical trial exclusion criterion. Annotated with entity spans:
Patients [Observation: previously enrolled in this trial]